Clinical trial exclusion criterion:
Evidence of active infection within 3 days of first dose of 852A

Entity relations:
- AND("Evidence", "active infection")
- AND("within 3 days of first dose", "852A")
- Has_temporal("Evidence", "within 3 days of first dose")